1歲半的幼兒，昨晚發燒、咳嗽，今天到急診。醫師發現呼吸聲音變得明顯，聽診雙側有喘息音 （Wheezing），給與短效型支氣管擴張劑（Bronchodilator）後，喘息音沒有改變，下列何種診斷最有可
 能？
A. 上呼吸道感染（Upper respiratory tract infection）
B. 細支氣管炎（Bronchiolitis）
C. 氣喘（Asthma）
D. 氣道異物阻塞（Airway foreign body obstruction）

正確答案：B. 細支氣管炎（Bronchiolitis）